一位男性病人腹壁疼痛去看門診，醫師說這是從腹直肌外側跑出來的疝氣，此種疝氣稱為？
A. Littre's hernia
B. Richter's hernia
C. Spigelian hernia
D. Obsturator hernia

正確答案：C. Spigelian hernia